Clinical trial exclusion criterion:
Cancer requiring treatment in past year (except skin)

Annotated entities:
- Condition: "Cancer"
- Procedure: "treatment"
- Temporal: "past year"